Clinical trial inclusion criterion:
diagnosed any form of MS (relapsing remitting, primary progressive, secondary progressive), any EDSS (expanded stability status scale) score

Annotated entities:
- Condition: "MS"
- Qualifier: "relapsing remitting"
- Qualifier: "primary progressive"
- Qualifier: "secondary progressive"
- Qualifier: "any form"
- Value: "any"
- Measurement: "score EDSS"
- Measurement: "expanded stability status scale"